patient refusal.

The above is a clinical trial exclusion criterion. Annotated with entity spans:
[Informed_consent: patient refusal].